Clinical trial exclusion criterion:
Severe male factor infertility (Total motile sperm count < 5 million/ml and/or normal WHO morphology <20%).

Annotated entities:
- Condition: "male factor infertility"
- Qualifier: "Severe"
- Measurement: "Total motile sperm count"
- Value: "< 5 million/ml"
- Measurement: "normal WHO morphology"
- Value: "<20%"